Agrees not to donate blood to a blood bank throughout participation in the study and for at least 3 months after last study day

The above is a clinical trial inclusion criterion. Annotated with entity spans:
A[Non-query-able: grees not to donate blood to a blood bank throughout participation in the study and for at least 3 months after last study day]